Which method is behind HipMCL?

While various clustering algorithms have been proposed to find highly connected regions, Markov Clustering (MCL) has been one of the most successful approaches to cluster sequence similarity or expression networks. HipMCL is based on MPI and OpenMP and is freely available under a modified BSD license.